Cuando el profesional enfermero está realizando la auscultación pulmonar a un paciente y encuentra un sonido corto, definido, como de crujido o borboteo, puede registrar que el paciente presenta:
1. Crepitantes.
2. Sibilancias.
3. Soplo por fricción.
4. Murmullo vesicular.

Respuesta correcta: 1. Crepitantes.